下列有關甲狀腺激素（thyroid hormones）之敘述，何者錯誤？
A. 主要藉由血液中結合蛋白（binding protein）運送至標的細胞（target cell）
B. 游離型（free-form）激素主要藉由結合標的細胞細胞膜上之受器（receptor）
C. 血中半衰期較一般胜肽類（peptide）激素為長
D. 可調控標的細胞之基因轉錄（transcription）

正確答案：B. 游離型（free-form）激素主要藉由結合標的細胞細胞膜上之受器（receptor）